大多數的癌症會經由淋巴管轉移（lymphatic metastasis），因此淋巴結廓清手術是惡性腫瘤手術的重要步 驟。下列何種惡性腫瘤因很少有淋巴結轉移（< 5%），所以不需常規進行淋巴結廓清手術？
A. 胃癌
B. 軟組織肉瘤
C. 大腸癌
D. 胰臟癌

正確答案：B. 軟組織肉瘤